Previous enrolment in this or current enrolment in a potentially confounding tria

The above is a clinical trial exclusion criterion. Annotated with entity spans:
[Competing_trial: Previous enrolment in this or current enrolment in a potentially confounding tria]